Clinical trial exclusion criterion:
known or suspected bowel obstruction

Entity relations:
- Has_mood("bowel obstruction", "known")
- OR("known", "suspected")